Clinical trial inclusion criterion:
Systemically healthy adults.

Entity relations:
- Has_qualifier("healthy", "Systemically")